下列何者最適合與 Aminoglycoside 合併使用來治療葡萄球菌的感染？
A. Amoxicillin
B. Tetracycline
C. Nafcillin
D. Erythromycin

正確答案：C. Nafcillin